Which is the main reason for the increase in the incidence of cryptococcal disease?

It is an increasing cause of infection in immunosuppressed patients with aids in the united kingdom are known to have developed cryptococcosis. It is an increasing cause of infection in immunosuppressed patients, most notably those with hiv infection. It is an increasing cause of infection with cryptococcus neoformans has increased four-fold in the last decade.